Clinical trial exclusion criterion:
Patients who have undergone a previous solid organ transplant (including kidney transplant) or who are going to receive another solid organ transplant concomitantly.

Entity relations:
- Subsumes("solid organ transplant", "kidney transplant")
- Has_qualifier("solid organ transplant", "another")
- Has_temporal("solid organ transplant", "concomitantly")
- Has_temporal("solid organ transplant", "previous")